在人類卵巢濾泡（follicle）成熟過程中，於何階段出現cumulus oophorus？
A. primary follicle
B. mature follicle
C. preantral follicle
D. early antral follicle

正確答案：B. mature follicle